Clinical trial exclusion criterion:
Known chronic liver disease, renal disease requiring dialysis or bleeding disorder

Annotated entities:
- Condition: "chronic liver disease"
- Condition: "renal disease"
- Procedure: "dialysis"
- Condition: "bleeding disorder"
- Mood: "requiring"